Clinical trial exclusion criterion:
Allergy to bupivacaine.

Entity relations:
- AND("Allergy", "bupivacaine")